Patients with severe cardiac insufficiency patients taking Coumadin or other warfarin-containing agents with the exception of low dose warfarin (1 mg or less) for the maintenance of in-dwelling lines or ports

The above is a clinical trial exclusion criterion. Annotated with entity spans:
Patients with [Condition: severe cardiac insufficiency] patients taking [Drug: Coumadin] or other [Drug: warfarin-containing agents] [Negation: with the exception of] [Qualifier: low dose] [Drug: warfarin] ([Multiplier: 1 mg or less]) for the maintenance of [Device: in-dwelling lines] or ports